Patients must have a VAS (Visual analog scale) >=40mm

The above is a clinical trial inclusion criterion. Annotated with entity spans:
Patients must have a [Measurement: VAS (Visual analog scale)] [Value: >=40mm]